Clinical trial exclusion criterion:
Have participated in any other studies involving investigational products within 30 days prior to entry into this study.

Annotated entities:
- Observation: "Have participated in any other studies involving investigational products"
- Temporal: "within 30 days prior to entry into this study"
- Reference_point: "entry into this stud"